Patients receiving medications highly bound to plasma proteins eg. Warfarin.

The above is a clinical trial exclusion criterion. Annotated with entity spans:
Patients receiving [Drug: medications highly bound to plasma proteins] eg. [Drug: Warfarin].